Clinical trial exclusion criterion:
Other serious illness or medical conditions

Annotated entities:
- Condition: "serious illness"
- Condition: "medical conditions"